臨床試驗中，實施受試者單盲程序（single blind）之主要目的為何？
A. 去除干擾作用
B. 去除「霍桑效應（Hawthorne Effect）」
C. 去除研究者的系統性偏差
D. 去除樣本數太小所造成的誤差

正確答案：B. 去除「霍桑效應（Hawthorne Effect）」